Dentro de todos los efectos adversos que se conocen de los agentes plaquetarios como el Clopidogrel, ¿cuáles de ellos son los considerados como menos graves?:
1. Síndrome pseudogripal, cefalea, mareos y erupción o prurito.
2. Sudoración profusa y náuseas.
3. Arritmia e hipotensión.
4. Dolor abdominal moderado y cefalea.
5. Disnea y edema en MMII.

Respuesta correcta: 1. Síndrome pseudogripal, cefalea, mareos y erupción o prurito.